What effect does Methylsulfonylmethane (MSM) have on inflammation?

Methylsulfonylmethane (MSM) is a naturally occurring compound that demonstrates anti-inflammatory effects in humans and various animal and cell culture models.